腦外傷病人的肌張力（muscle tone）增加，下列何者不是積極治療之適應症？
A. 影響主動動作
B. 產生關節攣縮
C. 影響照顧者為病人擺位及清潔
D. 肢體麻木感

正確答案：D. 肢體麻木感